Clinical trial inclusion criterion:
Newly diagnosed or without steroid use during last 1 year

Annotated entities:
- Negation: "without"
- Drug: "steroid"
- Temporal: "during last 1 year"